Clinical trial inclusion criterion:
Informed consent as documented by signature (see informed consent form)

Annotated entities:
- Post-eligibility: "Informed consent as documented by signature (see informed consent form)"